Have read and signed the IRB-approved Informed Consent form for participating in the study.

The above is a clinical trial inclusion criterion. Annotated with entity spans:
[Post-eligibility: Have read and signed the IRB-approved Informed Consent form for participating in the study.]